下頜舌骨肌（Mylohyoid muscle）受何神經支配？
A. 第五顱神經第三支
B. 舌咽神經（Glossopharyngeal nerve）
C. 第一頸椎神經
D. 舌下神經（Hypoglossal nerve）

正確答案：A. 第五顱神經第三支